any other pelvic pathology causing pain

The above is a clinical trial exclusion criterion. Annotated with entity spans:
any [Undefined_semantics: other pelvic pathology causing pain]